Clinical trial exclusion criterion:
Clinically significant cardiac arrhythmia or other cardiac disease (including congestive heart failure), uncontrolled diabetes mellitus, clinically significant respiratory disease, or known immunosuppression

Annotated entities:
- Condition: "cardiac arrhythmia"
- Condition: "cardiac disease"
- Condition: "congestive heart failure"
- Condition: "diabetes mellitus"
- Qualifier: "uncontrolled"
- Condition: "respiratory disease"
- Qualifier: "clinically significant"
- Non-query-able: "clinically significant"
- Subjective_judgement: "clinically significant"
- Condition: "immunosuppression"